一位 70 歲男性，最近數月天天頭痛且視力模糊。頭痛位置在左側顳部，非搏動性疼痛（non-throbbing pain），每天頭痛時間達數小時之久，頭痛時並沒有噁心、嘔吐或流淚等症狀。病患同時抱怨全身倦怠、發燒及肌肉疼痛。身體檢查發現左側淺部顳動脈（superficial temporal artery）變硬且附近皮膚有紅腫。以下那個檢查，對診斷最有幫助？
A. 類風濕因子（Rheumatoid factor, RF）
B. 紅血球沈降速率（Erythrocyte sedimentation rate, ESR）
C. HLA-typing
D. 腫瘤標記（Tumor markers）

正確答案：B. 紅血球沈降速率（Erythrocyte sedimentation rate, ESR）